Current use of mixed agonist/antagonist (such as pentazocine, nalbuphine or butorphanol) and partial agonist (buprenorphine) analgesics

The above is a clinical trial exclusion criterion. Annotated with entity spans:
Current use of mixed agonist/antagonist (such as [Drug: pentazocine], [Drug: nalbuphine] or [Drug: butorphanol]) and partial agonist ([Drug: buprenorphine]) analgesics